Clinical trial exclusion criterion:
Invasion of central nervous system;

Entity relations:
- Has_qualifier("Invasion", "central nervous system")